Clinical trial inclusion criterion:
Newly diagnosed and untreated sputum smear positive tuberculosis patient

Annotated entities:
- Qualifier: "untreated"
- Qualifier: "Newly diagnosed"
- Measurement: "sputum smear"
- Value: "positive"
- Condition: "tuberculosis"